於一般臨床診療，下列何者是造成多發性神經病變之最常見原因？
A. 慢性酒精中毒
B. 鉛中毒
C. 糖尿病
D. 尿毒症

正確答案：C. 糖尿病